人體經由靜脈注射 4 mg/kg 之 thiopental，可以觀察到下列何種現象？
A. 心跳速率減緩及血壓下降
B. 腦血管收縮及腦血流量（cerebral blood flow）減少
C. 潮氣容積（tidal volume）增加，且呼吸速率加快
D. 有止痛的效果（analgesic effect）

正確答案：B. 腦血管收縮及腦血流量（cerebral blood flow）減少